胃腸道分泌液中，含重碳酸離子(HCO3-)最高者為：
A. 胃液
B. 小腸液
C. 胰液
D. 膽汁

正確答案：C. 胰液